Clinical trial inclusion criterion:
patients undergoing venous malformation embolization operation through general anesthesia.

Annotated entities:
- Procedure: "venous malformation embolization operation"
- Procedure: "general anesthesia"